Clinical trial exclusion criterion:
dextromethorphan in any form (eg, OTC cold medicines)

Annotated entities:
- Drug: "dextromethorphan"
- Qualifier: "any form"